Clinical trial exclusion criterion:
Fistula with multiple tracts

Entity relations:
- Has_qualifier("Fistula", "multiple tracts")